Clinical trial inclusion criterion:
Have sickle cell disease (confirmed by Hb electrophoresis or more specific tests) or other conditions with iron overload from repeated blood transfusions (see exclusion criteria for exceptions);

Entity relations:
- AND("sickle cell disease", "Hb electrophoresis")
- Has_multiplier("blood transfusions", "repeated")
- AND("other conditions with iron overload", "blood transfusions")
- OR("Hb electrophoresis", "more specific tests")
- OR("sickle cell disease", "other conditions with iron overload")